Clinical trial exclusion criterion:
History of a primary sleep disorder other than RLS that may significantly affect the symptoms of RLS.

Entity relations:
- Has_negation("RLS", "other")